Active bleeding or known significant bleeding risk (e.g., gastrointestinal ulcer, malignant neoplasms, injuries or recent surgeries of the brain, spinal cord or eyes, recent intracranial bleedings, known or suspected esophagus varices, aneurysms or intraspinal or intracranial vascular abnormalities)

The above is a clinical trial exclusion criterion. Annotated with entity spans:
[Condition: Active bleeding] or known [Qualifier: significant] [Observation: bleeding risk] (e.g., [Condition: gastrointestinal ulcer], [Condition: malignant neoplasms], [Condition: injuries] or recent [Procedure: surgeries] of the [Qualifier: brain], [Qualifier: spinal cord] or [Qualifier: eyes], recent [Condition: intracranial bleedings], known or suspected [Condition: esophagus varices], [Condition: aneurysms] or [Qualifier: intraspinal] or [Qualifier: intracranial] [Condition: vascular abnormalities)]